Clinical trial inclusion criterion:
2. Diagnosis of venous leg ulcer(s), as clinically determined by the investigator by a positive venous reflux test (venous refilling <20 seconds) using Doppler ultrasound for at least 4 weeks prior to screening day, which have not adequately responded to conventional ulcer therapy.

Entity relations:
- Has_value("venous reflux test", "positive")
- Has_value("venous refilling", "<20 seconds")
- Subsumes("positive", "venous refilling")
- Has_index("at least 4 weeks prior to screening day", "screening day")
- Has_temporal("Doppler ultrasound", "at least 4 weeks prior to screening day")
- Has_negation("responded", "not")
- Has_qualifier("responded", "adequately")
- Has_context("conventional ulcer therapy", "responded")
- AND("venous leg ulcer(s)", "venous reflux test")
- AND("venous reflux test", "Doppler ultrasound")